marked brain atrophy as detected by magnetic resonance imaging

The above is a clinical trial exclusion criterion. Annotated with entity spans:
marked [Condition: brain atrophy] as detected by [Procedure: magnetic resonance imaging]